Toxic epidermal necrolysis with SCORTEN 1 to 5 at admission

The above is a clinical trial inclusion criterion. Annotated with entity spans:
[Condition: Toxic epidermal necrolysis] with [Measurement: SCORTEN] [Value: 1 to 5] [Temporal: at admission]